El trastorno de despersonalización, según el DSM-IV-TR, forma parte de:
1. Los trastornos esquizofrénicos.
2. Los trastornos disociativos.
3. Los trastornos somatomorfos.
4. Los trastornos del estad de ánimo.
5. Los trastornos de personalidad.

Respuesta correcta: 2. Los trastornos disociativos.